Clinical trial exclusion criterion:
Have an Axis I diagnosis of Schizophrenia, Schizoaffective Disorder, Schizophreniform Disorder or Bipolar I Disorder as diagnosed by the Structured Clinical Interview for DSM-IV Axis I Disorders (SCID-I), and pertinent subsequent for ruling out exclusionary diagnoses.

Annotated entities:
- Condition: "Schizophrenia"
- Condition: "Schizoaffective Disorder"
- Condition: "Schizophreniform Disorder"
- Condition: "Bipolar I Disorder"
- Procedure: "Structured Clinical Interview for DSM-IV Axis I Disorders (SCID-I)"